下列有關成人睪丸生殖細胞腫瘤（testicular germ cell tumor）的敘述， 何者較不正確？
A. 卵黃囊腫瘤（yolk sac tumor）常常為單一組織學型態，很少與其他組織學型態如胚胎癌（embryonal
B. 精母細胞瘤（seminoma）是最常見的組織學型態
C. 胚胎癌（embryonal carcinoma）的腫瘤生物特性較精母細胞瘤（seminoma）更具侵襲性
D. 由絨毛膜癌（choriocarcinoma）單一組織學型態所組成的睪丸腫瘤相當罕見

正確答案：A. 卵黃囊腫瘤（yolk sac tumor）常常為單一組織學型態，很少與其他組織學型態如胚胎癌（embryonal